Male or female >= 18 years of age

The above is a clinical trial inclusion criterion. Annotated with entity spans:
[Person: Male] or [Person: female] [Value: >= 18 years] of [Person: age]